The attending clinician has equipoise regarding the duration of therapy

The above is a clinical trial inclusion criterion. Annotated with entity spans:
[Non-representable: The attending clinician has equipoise regarding the duration of therapy]